Clinical trial exclusion criterion:
allergy to morphine or ketamine

Entity relations:
- AND("allergy", "morphine")
- OR("morphine", "ketamine")